Clinical trial inclusion criteria:
Patients over the age of 18 years who are able to give their informed consent
Lobar and sublobar resections
Open, video-assisted thoracoscopic or robotic surgeries
Diagnostic or therapeutic procedures

Annotated entities:
- Person: "over the age of 18 years"
- Observation: "able to give their informed consent"
- Procedure: "sublobar resections"
- Procedure: "Lobar resections"
- Procedure: "robotic surgeries"
- Qualifier: "video-assisted"
- Procedure: "thoracoscopic surgeries"
- Procedure: "therapeutic procedures"
- Procedure: "Diagnostic procedures"